功能不良性子宮出血（dysfunctional uterine bleeding）最常見的機轉為何？
A. 濾泡期太短（short follicular phase）
B. 黃體期不足（inadequate luteal phase）
C. 無排卵周期（anovulatory cycle）
D. 外源性黃體激素（exogenous progesterone）

正確答案：C. 無排卵周期（anovulatory cycle）